History of neurological injury: head trauma, poorly-controlled seizure disorder (seizure within the preceding six months), stroke, prior neurosurgery, or under the care of a neurologist or neurosurgeon as determined by interview

The above is a clinical trial exclusion criterion. Annotated with entity spans:
[Temporal: History] of [Condition: neurological injury]: [Condition: head trauma], [Qualifier: poorly-controlled] [Condition: seizure disorder] ([Condition: seizure] [Temporal: within the preceding six months]), [Condition: stroke], [Temporal: prior] [Condition: neurosurgery], or [Observation: under the care of a neurologist] or neurosurgeon as determined by interview